一位 45 歲女性，甲狀腺機能亢進接受 propylthiouracil 治療半年，因有過敏同時給 prednisolone（5 mg）每天兩顆，病人接受甲狀腺右葉全切除及左葉次全切除。第二天病人體溫為 38.3℃，全身無力，血壓較低，下列檢查何者對診斷最有幫助？
A. 血中 T3
B. 血中 T4
C. 血中 TSH
D. 血中可體松（cortisol）及 ACTH

正確答案：D. 血中可體松（cortisol）及 ACTH